Clinical trial inclusion criterion:
Able to walk unassisted

Annotated entities:
- Procedure: "walk unassisted"
- Mood: "Able to"